Clinical trial exclusion criterion:
Treated with rituximab in the last 12 months

Annotated entities:
- Drug: "rituximab"
- Temporal: "in the last 12 months"